地癢疹（ground itch）是由下列何種人類寄生蟲感染所引起？
A. 日本血吸蟲（Schistosoma japonicum）
B. 美洲鉤蟲（Necator americanus）
C. 班氏絲狀蟲（Wuchereria bancrofti）
D. 廣東住血線蟲（Angiostrongylus cantonensis）

正確答案：B. 美洲鉤蟲（Necator americanus）